2. Patients who are eligible for coronary revascularization (angioplasty or CABG);

The above is a clinical trial inclusion criterion. Annotated with entity spans:
2. Patients who are [Mood: eligible for] [Procedure: coronary revascularization] ([Procedure: angioplasty] or [Procedure: CABG]);